乳癌最少發生遠處轉移的器官為：
A. 肺
B. 骨骼
C. 肝
D. 心

正確答案：D. 心